Clinical trial inclusion criterion:
Willingness to replace the missing tooth/teeth with dental implants

Annotated entities:
- Post-eligibility: "Willingness to replace the missing tooth/teeth with dental implants"